Clinical trial exclusion criterion:
Treprostinil contraindications: Known hypersensitivity to treprostinil or any of the excipients, Pulmonary arterial hypertension related to veno-occlusive disease, Congestive heart failure due to severe left ventricular dysfunction, Severe hepatic insufficiency (Child-Pugh stage C), Evolving gastrointestinal ulcer, intracranial hemorrhage, recent trauma or other clinical condition that may lead to bleeding, Congenital or acquired valvular abnormalities with cardiac repercussions, Severe ischemic heart disease or unstable angina; Myocardial infarction in the last six months; Decompensated cardiac insufficiency not medically controlled; Severe arrhythmias; Cerebrovascular lesions (such as transient ischemic attack, stroke) that occurred within the last three months.

Entity relations:
- AND("contraindications", "Treprostinil")
- AND("hypersensitivity", "treprostinil")
- Subsumes("treprostinil", "any of the excipients")
- AND("Pulmonary arterial hypertension", "veno-occlusive disease")
- Has_qualifier("left ventricular dysfunction", "severe")
- Has_qualifier("hepatic insufficiency", "Severe")
- Has_value("Child-Pugh", "stage C")
- Subsumes("Severe", "Child-Pugh")
- Has_qualifier("gastrointestinal ulcer", "Evolving")
- Has_temporal("trauma", "recent")
- Has_qualifier("Congenital valvular abnormalities", "with cardiac repercussions")
- Has_qualifier("acquired valvular abnormalities", "with cardiac repercussions")
- Has_qualifier("ischemic heart disease", "Severe")
- Has_temporal("Myocardial infarction", "in the last six months")
- Has_qualifier("Decompensated cardiac insufficiency", "not medically controlled")
- Has_qualifier("arrhythmias", "Severe")
- AND("Decompensated cardiac insufficiency", "arrhythmias")
- Subsumes("Cerebrovascular lesions", "transient ischemic attack")
- Has_temporal("Cerebrovascular lesions", "within the last three months")
- OR("left ventricular dysfunction", "hepatic insufficiency")
- OR("clinical condition that may lead to bleeding", "ischemic heart disease", "acquired valvular abnormalities", "Congenital valvular abnormalities", "Myocardial infarction", "Decompensated cardiac insufficiency", "Cerebrovascular lesions", "unstable angina")
- OR("transient ischemic attack", "stroke")